Clinical trial exclusion criterion:
Concomitant use with oral anticoagulant drugs

Annotated entities:
- Temporal: "Concomitant"
- Drug: "oral anticoagulant drugs"